Al formular comprimidos con principios activos que se utilizan a dosis relativamente bajas es necesario adicionar excipientes cuya función primordial es obtener un comprimido de un tamaño razonable. ¿Cómo se denominan esos excipientes?
1. Adsorbentes.
2. Aglutinantes.
3. Disgregantes.
4. Diluyentes.
5. Lubricantes.

Respuesta correcta: 4. Diluyentes.